Clinical trial inclusion criterion:
Adult patients (> 18 years) scheduled for cardiopulmonary bypass surgery with Glomerular Filtration Rate (GFR) greater than or equal to 60 and left ventricular ejection fraction greater than or equal to 40%

Annotated entities:
- Person: "Adult"
- Value: "> 18 years"
- Person: "years"
- Procedure: "cardiopulmonary bypass surgery"
- Measurement: "Glomerular Filtration Rate (GFR)"
- Value: "greater than or equal to 60"
- Measurement: "left ventricular ejection fraction"
- Value: "greater than or equal to 40%"
- Mood: "scheduled for"